Clinical trial inclusion criterion:
Subject must have been previously immunized for smallpox, at =3 years prior to commencement of screening assessments, and vaccination history must be confirmed by oral or written history and the presence of a visible pathognomonic smallpox vaccination scar.

Entity relations:
- AND("immunized", "smallpox")
- Has_temporal("immunized", "3 years prior to commencement of screening assessments")
- Has_index("3 years prior to commencement of screening assessments", "commencement of screening assessments")